Clinical trial inclusion criterion:
Scheduled for elective posterior lumbar spinal fusion surgery between 1 and 3 levels

Entity relations:
- Has_qualifier("posterior lumbar spinal fusion surgery", "elective")
- Has_mood("posterior lumbar spinal fusion surgery", "Scheduled for")
- Has_qualifier("posterior lumbar spinal fusion surgery", "between 1 and 3 levels")